Clinical trial inclusion criterion:
Diagnosed epileptic patients of either sex with age between 10-19 yrs (<19yrs), coming to the medicine Out Patient /In Patient Departments and undergoing AED therapy for more than 6 months.

Annotated entities:
- Condition: "epileptic"
- Person: "age"
- Value: "between 10-19 yrs"
- Value: "<19yrs"
- Visit: "Out Patient Departments"
- Visit: "In Patient Departments"
- Procedure: "AED therapy"
- Temporal: "for more than 6 months"